下列有關急性間歇性紫質症（acute intermittent porphyria）的敘述，何者錯誤？
A. 自體隱性遺傳之銅代謝異常的疾病
B. 磺胺類抗生素會誘發具有此遺傳基因之患者發病
C. 發病時會出現急性多發性神經炎
D. 發病時會有不明原因之腹痛

正確答案：A. 自體隱性遺傳之銅代謝異常的疾病